下列那一個腹部器官在腹部鈍傷中最常受到傷害？
A. 肝臟
B. 腎臟
C. 脾臟
D. 胰臟

正確答案：C. 脾臟